Patients with liver cirrhosis, Hepatocellular Carcinoma or AFP >2 ULN or other malignancies.

The above is a clinical trial exclusion criterion. Annotated with entity spans:
Patients with [Condition: liver cirrhosis], [Condition: Hepatocellular Carcinoma] or [Measurement: AFP] [Value: >2 ULN] or other [Condition: malignancies].